Prior radiation therapy, chemotherapy, or surgery in patients requiring flap reconstruction in the head and neck region.

The above is a clinical trial inclusion criterion. Annotated with entity spans:
[Temporal: Prior] [Procedure: radiation therapy], [Procedure: chemotherapy], or [Procedure: surgery] in patients [Condition: requiring flap reconstruction] in the [Qualifier: head and neck region].